下列神經系統疾病的好發位置，何者錯誤？
A. Langerhans cell histiocytosis好發於suprasellar region and skull bones
B. germ cell tumor好發於suprasellar and pineal regions
C. mycotic aneurysm好發於branches of middle and posterior cerebral arteries
D. dissecting aneurysm好發於anterior communicating artery and basilar tip

正確答案：D. dissecting aneurysm好發於anterior communicating artery and basilar tip